Clinical trial exclusion criterion:
Patients not scheduled for trans-jugular liver biopsy

Annotated entities:
- Negation: "not"
- Mood: "scheduled"
- Procedure: "trans-jugular liver biopsy"